Clinical trial exclusion criterion:
13. HIV medications: efavirenz, etravirine, all ritonavir boosted and unboosted HIV protease inhibitors

Entity relations:
- AND("HIV protease inhibitors", "ritonavir")
- Has_qualifier("HIV protease inhibitors", "ritonavir boosted")
- v-AND("HIV protease inhibitors", "and")
- OR("ritonavir boosted", "ritonavir unboosted")
- OR("efavirenz", "etravirine", "HIV protease inhibitors")